diseases of red blood cells

The above is a clinical trial exclusion criterion. Annotated with entity spans:
[Condition: diseases of red blood cells]